施予及撤除維生治	的措施必須有條件施行，才符合醫學	，下列那一項不適當？
A. 無效醫
B. 生命品質過差
C. 無心智能	之病人拒絕治
D. 治	效果極差且耗用醫療資源極大

正確答案：C. 無心智能	之病人拒絕治